Clinical trial exclusion criterion:
1. Institutionalized subjects will not be used. 2 Social Habits:

Annotated entities:
- Parsing_Error: "1."
- Non-query-able: "Institutionalized subjects will not be used."
- Parsing_Error: "2 Social Habits:"